軟骨細胞（chondrocyte）的分化與下列何者無關？
A. 纖維母細胞（fibroblast）
B. 軟骨原細胞（chondrogenic cell）
C. 軟骨母細胞（chondroblast）
D. 間葉細胞（mesenchymal cell）

正確答案：A. 纖維母細胞（fibroblast）